Patients above 65 years of age ( Physiology difference)

The above is a clinical trial exclusion criterion. Annotated with entity spans:
Patients [Value: above 65 years] of [Person: age] ( Physiology difference)